Clinical trial exclusion criterion:
presence of a homogeneously echogenic effusion on pleural US27 -

Entity relations:
- AND("homogeneously echogenic effusion", "pleural US")